Pulmonary disorders, including COPD and asthma

The above is a clinical trial exclusion criterion. Annotated with entity spans:
[Condition: Pulmonary disorders], including [Condition: COPD] and [Condition: asthma]